Clinical trial inclusion criterion:
Body mass index > 30Kg/m2 or > 27.5 Kg/m2 (South Asian),

Entity relations:
- Has_value("Body mass index", "> 30Kg/m2")
- OR("> 30Kg/m2", "> 27.5 Kg/m2")